Systemic infection

The above is a clinical trial exclusion criterion. Annotated with entity spans:
[Condition: Systemic infection]